有關醫藥分業在保障民眾就醫與藥品安全的權利之敘述，下列何項較不正確？
A. 保障民眾就醫及持有處方的基本權利
B. 民眾有自由「選擇」處方調劑場所的權利
C. 藥品調劑與交付須經專業藥師服務的權利
D. 民眾有使用藥品與相關資訊等「知」與「被告知」的權利

正確答案：C. 藥品調劑與交付須經專業藥師服務的權利